未曾活化之B細胞（naïve B cell）細胞膜上出現IgD，其機制為何？
A. 免疫球蛋白基因重組（recombination of Ig variable gene segments）
B. 免疫球蛋白基因超變異轉換重組（Ig gene hypermutation）
C. 免疫球蛋白重鏈RNA剪接（Ig heavy chain RNA splicing）
D. 免疫球蛋白輕鏈RNA剪接（Ig light chain RNA splicing）

正確答案：C. 免疫球蛋白重鏈RNA剪接（Ig heavy chain RNA splicing）